History of intolerance (including Grade 3-4 infusion reaction) or hypersensitivity to trastuzumab, murine proteins, or docetaxel.

The above is a clinical trial exclusion criterion. Annotated with entity spans:
[Temporal: History of] [Condition: intolerance] (including [Measurement: Grade] [Value: 3-4] [Condition: infusion reaction]) or [Condition: hypersensitivity] to [Drug: trastuzumab], [Drug: murine proteins], or [Drug: docetaxel].